Clinical trial inclusion criterion:
Laparoscopic cholecystectomy

Entity relations:
- Has_qualifier("cholecystectomy", "Laparoscopic")